Clinical trial inclusion criterion:
Female gender

Annotated entities:
- Person: "Female"